Presence of documented ST-elevation myocardial infarction confirmed by ECG, as well as troponin I and CK-MB levels.

The above is a clinical trial inclusion criterion. Annotated with entity spans:
Presence of documented [Condition: ST-elevation myocardial infarction] confirmed by [Procedure: ECG], as well as [Measurement: troponin I] and [Measurement: CK-MB] levels.